Subjects with a history of asthma exacerbation requiring the use of systemic corticosteroids (tablets, suspension, or injection) for at least 3 days or a depot corticosteroid injection or emergency room attendance (within 3 months) or requiring hospitalization for asthma (within 6 months) prior to screening.

The above is a clinical trial exclusion criterion. Annotated with entity spans:
Subjects with a [Temporal: history] of [Condition: asthma exacerbation] requiring the use of [Drug: systemic corticosteroids] (tablets, suspension, or injection) [Temporal: for at least 3 days] or a [Drug: depot corticosteroid injection] or [Procedure: emergency room attendance] ([Temporal: within 3 months]) or requiring [Procedure: hospitalization] for [Condition: asthma] ([Temporal: within 6 months]) prior to screening.